Clinical trial exclusion criterion:
History of drug/alcohol abuse.

Annotated entities:
- Condition: "drug/alcohol abuse"
- Temporal: "History"